treated hypertension

The above is a clinical trial inclusion criterion. Annotated with entity spans:
[Qualifier: treated] [Condition: hypertension]